Clinical trial exclusion criterion:
State after kidney transplantation

Entity relations:
- multi("kidney transplantation", "State after kidney transplantation")